Clinical trial exclusion criterion:
Suspected subarachnoid hemorrhage;

Annotated entities:
- Condition: "subarachnoid hemorrhage"